Multiple pain sources and multifactorial pain sources that complicated or confound diagnosing the SI joint as the primary and predominant pain generator that may contribute to low back pain (including but not limited to: lumbar diagnosis, lumbar radiculopathy, intra or extra-articular hip pathology to include acetabulum and femoral head, lumbo-sacral joint pathology, intervertebral disk disease, spondylolisthesis/spondylosis/spondylolysis of lumbar vertebra)

The above is a clinical trial exclusion criterion. Annotated with entity spans:
[Condition: Multiple pain sources] and [Condition: multifactorial pain sources] [Non-representable: that complicated or confound diagnosing the SI joint as the primary and predominant pain generator that may contribute to low back pain] (including but not limited to: [Condition: lumbar diagnosis], [Condition: lumbar radiculopathy], [Condition: intra] or [Condition: extra-articular hip pathology] to include [Condition: acetabulum] and [Condition: femoral head], [Condition: lumbo-sacral joint pathology], [Condition: intervertebral disk disease], [Condition: spondylolisthesis]/[Condition: spondylosis]/[Condition: spondylolysis of lumbar vertebra])